Tay-Sachs 病是溶酵素體貯積病（lysosomal storage disease）之一，它是由於缺乏下列何種酵素所導致？
A. beta-N-acetylhexosaminidase
B. HMG-CoA reductase
C. alpha-1,4-glucosidase
D. amylo-1,6-glucosidase

正確答案：A. beta-N-acetylhexosaminidase